Be categorized as American Society of Anesthesiologists (ASA) Physical Status Class 1, 2, or 3.

The above is a clinical trial inclusion criterion. Annotated with entity spans:
Be categorized as [Measurement: American Society of Anesthesiologists (ASA) Physical Status Class] [Value: 1], [Value: 2], or [Value: 3].